Clinical trial inclusion criterion:
with the diagnosis of sepsis (as specified below) within the previous 24 hours

Entity relations:
- Has_temporal("sepsis", "within the previous 24 hours")